Clinical trial inclusion criterion:
Age 18-64 Enrollment will be limited to adults younger than 65 years because of the increased risk of adverse medication effects in the elderly.

Entity relations:
- Has_value("Age", "18-64")
- Has_value("adults", "younger than 65 years")
- AND("adverse effects", "medication")
- Has_mood("adverse effects", "increased risk")